El calcitriol o Vitamina D activa, induce:
1. Hipocalcemia.
2. Síntesis de calbindina en enterocitos.
3. Secreción de calcio en orina.
4. Secreción de PTH.
5. Disminución en la absorción intestinal de fosfato.

Respuesta correcta: 2. Síntesis de calbindina en enterocitos.